Clinical trial inclusion criteria:
Age over 18 years
Patients with rectal cancer stage: cT1-2-3, cN0-1, cM0.
Tumor equal or below 10 cm from the anal verge, candidates to (ETM) low anterior resection and anastomosis, with or without preoperative chemo-radiotherapy.
Adenocarcinoma of low or moderate differentiation
ASA I, II, III.

Annotated entities:
- Person: "Age"
- Value: "over 18 years"
- Condition: "rectal cancer"
- Qualifier: "stage"
- Measurement: "cT"
- Measurement: "cN"
- Measurement: "cM"
- Value: "1-2-3"
- Value: "0-1"
- Value: "0"
- Qualifier: "equal or below 10 cm from the anal verge"
- Mood: "candidates"
- Procedure: "low anterior resection"
- Procedure: "low anterior anastomosis"
- Temporal: "preoperative"
- Procedure: "chemo-radiotherapy"
- Condition: "Tumor"
- Condition: "Adenocarcinoma"
- Qualifier: "low or moderate differentiation"
- Measurement: "ASA"
- Value: "I, II, III"